Clinical trial exclusion criterion:
Moderate/Weak CYP3A inducers such as efavirenz and oxcarbazepine

Entity relations:
- Subsumes("Moderate CYP3A inducers", "efavirenz")
- OR("efavirenz", "oxcarbazepine")
- OR("Moderate CYP3A inducers", "Weak CYP3A inducers")